La reacción de bromo y ciclopenteno lleva a la obtención de 1,2-dibromociclopentano mediante un mecanismo:
1. De adición anti.
2. De adición syn.
3. De sustitución SN1.
4. De sustitución SN2.
5. De eliminación.

Respuesta correcta: 1. De adición anti.